¿Cuál de los siguientes factores se relaciona más con un incremento en la probabilidad de recurrencia de un episodio depresivo mayor?:
1. Comienzo temprano del primer episodio (i.e. edad temprana).
2. Menor edad actual.
3. Mayor número de episodios previos.
4. Ser mujer.

Respuesta correcta: 3. Mayor número de episodios previos.